Available Organ function: white blood cell=3.5×109/L, Neutrophils =1.5×109/L, Hemoglobin =80g/L, Blood platelet>100×109/L; Alanine aminotransferase (ALT) and Aspartate aminotransferase (AST)= 2.5 upper limit of normal(ULN); Total bilirubin (TBIL) <1.5 ULN;serum creatinine=1.5 ULN; creatinine clearance of = 50ml/min

The above is a clinical trial inclusion criterion. Annotated with entity spans:
Available Organ function: [Measurement: white blood cell][Value: =3.5×109/L], [Measurement: Neutrophils] [Value: =1.5×109/L], [Measurement: Hemoglobin] [Value: =80g/L], [Measurement: Blood platelet][Value: >100×109/L]; [Measurement: Alanine aminotransferase (ALT)] and [Measurement: Aspartate aminotransferase (AST)][Value: = 2.5 upper limit of normal(ULN)]; [Measurement: Total bilirubin (TBIL)] [Value: <1.5 ULN];[Measurement: serum creatinine][Value: =1.5 ULN]; [Measurement: creatinine clearance] of [Value: = 50ml/min]